History of eclampsia or other adverse CNS complication (e.g., stroke or PRES) in this pregnancy

The above is a clinical trial exclusion criterion. Annotated with entity spans:
History of [Condition: eclampsia] or other adverse [Condition: CNS complication] (e.g., [Condition: stroke] or [Condition: PRES]) [Temporal: in this pregnancy]